Clinical trial exclusion criterion:
Chronic HCV Infection with Genotype 2 or 3

Annotated entities:
- Condition: "Chronic HCV Infection"
- Qualifier: "Genotype 2"
- Qualifier: "Genotype 3"